Patients undergoing a loop ileostomy closure

The above is a clinical trial inclusion criterion. Annotated with entity spans:
Patients undergoing a [Procedure: loop ileostomy closure]